下列細菌中，何者最常引起燒傷所致的	血症？
A. Pseudomonas aeruginosa
B. E. coli
C. Proteus mirabilis
D. Klebsiella pneumoniae

正確答案：A. Pseudomonas aeruginosa